Clinical trial exclusion criterion:
Patients who have already received an epidural during this admission or requiring general anesthesia for cesarean birth

Entity relations:
- Has_temporal("epidural", "during this admission")
- Has_mood("general anesthesia", "requiring")
- AND("general anesthesia", "cesarean birth")
- OR("epidural", "general anesthesia")